46 歲男性病人因為左側膝關節退化性關節炎接受脛骨高位截骨矯正術（High tibial Osteotomy），手術後以長腿石膏固定膝關節，四個小時後病人抱怨腳趾頭麻痺，住院醫師前往檢視發現腳趾頭有明顯的發紺現象（cyanosis），當搬動腳趾時病人非常疼痛，幾乎無法忍受，請問下一步應該採取的處置何者最為適當？
A. 給予止痛劑，並且立即將患肢抬高
B. 冰敷，並且給予抗凝血劑，以免血管阻塞
C. 將石膏以及石膏棉捲完全剪開，並將患肢抬高
D. 緊急安排血管攝影，並安撫病人情緒

正確答案：C. 將石膏以及石膏棉捲完全剪開，並將患肢抬高